Clinical trial exclusion criterion:
6. Presence of abnormal physical finding on the vulva, vaginal walls or cervix during pelvic/speculum examination and/or colposcopy

Entity relations:
- causal("abnormal physical finding on the vulva", "pelvic examination")
- OR("abnormal physical finding on the vulva", "abnormal physical finding on the vaginal walls", "abnormal physical finding on the cervix")
- OR("pelvic examination", "speculum examination", "colposcopy")